Clinical trial inclusion criterion:
4. On a stable and recommended dose of UDCA for the past twelve months

Annotated entities:
- Parsing_Error: "4."
- Qualifier: "stable dose"
- Qualifier: "recommended dose"
- Drug: "UDCA"
- Temporal: "for the past twelve months"